Clinical trial inclusion criterion:
HCV RNA evidence of HCV infection

Annotated entities:
- Measurement: "HCV RNA"
- Condition: "HCV infection"